Clinical trial exclusion criterion:
Hormone treatment within the last 2 months

Annotated entities:
- Procedure: "Hormone treatment"
- Drug: "Hormone"
- Temporal: "within the last 2 months"